Patients with hepatopulmonary syndrome.

The above is a clinical trial exclusion criterion. Annotated with entity spans:
Patients with [Condition: hepatopulmonary syndrome].